Abuse of illicit drugs, according to medical decision;

The above is a clinical trial exclusion criterion. Annotated with entity spans:
[Condition: Abuse of illicit drugs], [Subjective_judgement: according to medical decision];